下列何種疾病之病原體是經由體蝨（body louse）傳播？
A. 流行性斑疹傷寒（epidemic typhus）
B. 地方性斑疹傷寒（endemic typhus）
C. 落磯山斑疹熱（Rocky mountain spotted fever）
D. 恙蟲病（scrub typhus）

正確答案：A. 流行性斑疹傷寒（epidemic typhus）